Clinical trial exclusion criterion:
Physical disabilities that prohibit task performance (such as blindness or deafness)

Entity relations:
- OR("blindness", "deafness")